Subjects who are smokers or who have quit smoking <5 years ago

The above is a clinical trial exclusion criterion. Annotated with entity spans:
Subjects who are [Observation: smokers] or who have [Observation: quit smoking] [Temporal: <5 years ago]